Clinical trial exclusion criterion:
In which a cardiac catheterization is planned a priori to be performed via femoral, brachial or ulnar.

Entity relations:
- Has_qualifier("cardiac catheterization", "femoral")
- OR("femoral", "brachial", "ulnar")